一位母親帶其 8 歲 6 個月之男孩求診，測量其身高為 130 公分（第 50-75 百分位），體重為 43 公斤（＞第 95 百分位），此男孩之身體質量指數（body mass index, BMI）為：
A. 23.7
B. 25.4
C. 26.6
D. 34.6

正確答案：B. 25.4